How does neuronal activity affect neuroligin-3?

Neuronal activity-induces secretion of neuroligin-3.